Are there drugs for Tick-borne Encephalitis?

No drug therapy available today